Clinical trial inclusion criterion:
medical indication for induction of labor

Annotated entities:
- Condition: "medical indication"
- Procedure: "induction of labor"